Preexisting medical condition (thyroid disease, diabetes mellitus, hypertension, pulmonary conditions, cardiac condition…).

The above is a clinical trial exclusion criterion. Annotated with entity spans:
Preexisting medical condition ([Condition: thyroid disease], [Condition: diabetes mellitus], [Condition: hypertension], [Condition: pulmonary conditions], [Condition: cardiac condition]…).